核酸去嘌呤作用（depurination of nucleotides）是破壞在連接鹼基（base residues）與核糖（ribose）的化學鍵。這個化學鍵稱為：
A. 氫鍵（hydrogen bond）
B. 糖苷鍵（N-glycosyl bond）
C. 磷酸二酯鍵（phosphodiester bond）
D. 醯胺鍵（amide bond）

正確答案：B. 糖苷鍵（N-glycosyl bond）